Clinical trial exclusion criterion:
History of exercise-related syncope

Annotated entities:
- Condition: "syncope"
- Qualifier: "exercise-related"
- Temporal: "History"